Clinical trial exclusion criterion:
Patients with previous lumbar surgery.

Annotated entities:
- Procedure: "lumbar surgery."